Clinical trial exclusion criteria:
Malignancy and other significant medical conditions that will impact follow up within this program.
Those less than 18 years of age.
Concomitant interstitial lung disease, sarcoidosis, other significant lung disease.
Those who have had a transplant.
Significant travel with work.
Unable to make appointments (every three to six months over 2 years).
Those residing in another country or planned absence for more than one month.

Annotated entities:
- Condition: "Malignancy"
- Condition: "medical conditions"
- Qualifier: "significant"
- Value: "less than 18 years"
- Person: "age"
- Condition: "interstitial lung disease"
- Condition: "sarcoidosis"
- Condition: "lung disease"
- Temporal: "Concomitant"
- Procedure: "transplant"
- Non-representable: "Significant travel with work."
- Post-eligibility: "Unable to make appointments (every three to six months over 2 years)."
- Non-representable: "Those residing in another country or planned absence for more than one month."